Clinical trial inclusion criterion:
Subjects chronically infected with HCV Genotype 1

Entity relations:
- Has_qualifier("HCV", "Genotype 1")
- multi("chronically", "chronically")
- Has_temporal("HCV", "chronically")